大腦動脈環（arterial circle of cerebrum）不包括：
A. 椎動脈（vertebral artery）
B. 大腦前動脈（anterior cerebral artery）
C. 大腦後動脈（posterior cerebral artery）
D. 後交通枝（posterior communicating artery）

正確答案：A. 椎動脈（vertebral artery）